Describe LowMACA

LowMACA is a computational tool for the analysis and visualization of somatic mutation data in cancer.